Clinical trial inclusion criterion:
Can have had prior Cesarean delivery

Annotated entities:
- Non-representable: "Can have had prior Cesarean delivery"